下列何者是第一期與第二期梅毒病灶中最主要的發炎反應細胞？
A. 淋巴球（lymphocyte）
B. 嗜中性白血球（neutrophil）
C. 漿細胞（plasma cell）
D. 嗜酸性白血球（eosinophil）

正確答案：C. 漿細胞（plasma cell）